Congestive heart failure

The above is a clinical trial inclusion criterion. Annotated with entity spans:
[Condition: Congestive heart failure]